Clinical trial exclusion criterion:
Congenital eye malformations in the study eye.

Entity relations:
- Has_qualifier("Congenital eye malformations", "in the study eye")